Clinical trial exclusion criterion:
Diagnosis of attention-deficit hyperactivity disorder (ADHD) is allowed, provided the patient is not receiving medication(s) known to affect the assessment of RLS.

Annotated entities:
- Condition: "attention-deficit hyperactivity disorder"
- Condition: "ADHD"
- Negation: "allowed"